List tele monitoring applications of miniaturised sensors

Home-polysomnography (HPSG)
Body weight
Blood pressure control
Heart failure control
Vital signs - disaster relief, dangerous outdoor sports and adventure monitoring, and antiterrorism activities.
Telemetric fetal home monitoring system for recording the trans-abdominal fetal heart signal and the uterine contractions
Vital signs - electrocardiograms (ECGs), temperature (T), and oxygen saturation (SaO2) , breath rate
Step-counting for tele-rehabilitation
Detection of falls in elderly